Ongoing substance use disorder with significant impact on activities of daily living. Difficult or impossible to determine whether cognitive or functional decline is due to substance use or HIV, or both

The above is a clinical trial exclusion criterion. Annotated with entity spans:
[Temporal: Ongoing] [Condition: substance use disorder] with significant [Condition: impact on activities of daily living]. [Non-query-able: Difficult or impossible to determine whether cognitive or functional decline is due to substance use or HIV, or both]